有關胃幽門桿菌（Helicobacter pylori）之特性，下列何者錯誤？
A. 為革蘭氏陰性菌
B. 為微需氧（microaerophilic）菌
C. 能產生氧化酶（oxidase）以避免菌體被胃酸破壞
D. 可用同位素尿素標識呼吸法（urea breath test）作鑑別診斷

正確答案：C. 能產生氧化酶（oxidase）以避免菌體被胃酸破壞